Clinical trial exclusion criterion:
immunization with PPV23 within the last year

Entity relations:
- AND("immunization", "PPV23")